診斷庫欣氏症（Cushing's syndrome）下列何者最可靠？
A. 早上8時皮醇（cortisol）血濃度
B. 隔夜1 mg dexamethasone抑制試
C. 半夜皮醇血濃度
D. 低劑量dexamethasone抑制試

正確答案：D. 低劑量dexamethasone抑制試